Clinical trial exclusion criterion:
6. History of any hypersensitivity or allergic reaction to any β-lactam antibacterial agent.

Annotated entities:
- Condition: "hypersensitivity"
- Condition: "allergic reaction"
- Drug: "β-lactam antibacterial agent"
- Temporal: "History"